¿Quién se encargó de elaborar el actual programa formativo de la especialidad de Enfermería Familiar y Comunitaria?
1. Las Unidades Docentes de la Comunidad Autónoma responsable.
2. La comisión de Enfermería del Ministerio de Sanidad, Servicios Sociales e Igualdad.
3. La Comisión Nacional de la Especialidad de Enfermería Familiar y Comunitaria.
4. Diseñado en el Real Decreto 450/2005, de 22 de abril, sobre especialidades de Enfermería.

Respuesta correcta: 3. La Comisión Nacional de la Especialidad de Enfermería Familiar y Comunitaria.